Clinical trial inclusion criterion:
Male and female patients, age 18-75 yrs.

Annotated entities:
- Person: "Male"
- Person: "female"
- Person: "age"
- Value: "18-75 yrs"